What is the name for anorexia in gymnasts?

Anorexia athletica